What kind of bonds are connecting keratin molecules?

cystine disulfide bonds
amide bonds
hydrogen bonds